Clinical trial exclusion criterion:
Irritable bowel syndrome (Rome-IV criteria for irritable bowel syndrome)

Entity relations:
- AND("Rome-IV criteria", "irritable bowel syndrome")